培亞氏斑（Peyer's patches）主要分布在下列何處？
A. 直腸（rectum）
B. 空腸（jejunum）
C. 迴腸（ileum）
D. 十二指腸（duodenum）

正確答案：C. 迴腸（ileum）